Clinical trial exclusion criterion:
Drug allergies: Any adverse reaction including immediate or delayed hypersensitivity to any intranasal, inhaled, or systemic corticosteroid therapy. Known or suspected sensitivity to the constituents of the ELLIPTA Inhaler (i.e., lactose, FF).

Entity relations:
- Subsumes("adverse reaction", "immediate hypersensitivity")
- AND("immediate hypersensitivity", "intranasal corticosteroid")
- Subsumes("Drug allergies", "adverse reaction")
- Subsumes("constituents of the ELLIPTA Inhaler", "lactose")
- AND("sensitivity", "constituents of the ELLIPTA Inhaler")
- OR("intranasal corticosteroid", "inhaled corticosteroid", "systemic corticosteroid")
- OR("immediate hypersensitivity", "delayed hypersensitivity")
- OR("lactose", "FF")